En cromatografía de intercambio iónico, el grupo funcional ácido carboxílico se emplea como:
1. Como intercambiador aniónico fuerte en resinas de intercambio iónico.
2. Como intercambiador catiónico fuerte en resinas de intercambio iónico.
3. Como intercambiador aniónico débil en resinas de intercambio iónico.
4. Como intercambiador catiónico débil en resinas de intercambio iónico.
5. No se utiliza nunca en intercambio iónico.

Respuesta correcta: 4. Como intercambiador catiónico débil en resinas de intercambio iónico.